Subjects considered by the Investigator to be unsuitable for the study.

The above is a clinical trial exclusion criterion. Annotated with entity spans:
[Non-query-able: Subjects considered by the Investigator to be unsuitable for the study].